En las últimas décadas y en relación con los test de aptitud y/o logro, la teoría clásica de los tests está siendo sustituida por:
1. La teoría del conglomerado.
2. La teoría de la respuesta al ítem.
3. La teoría ipsativa.
4. Las técnicas objetivas.

Respuesta correcta: 2. La teoría de la respuesta al ítem.